patient not previously scheduled for radiofrequency ablation of the cervical, thoracic, or lumbar facets, or sacroiliac joints

The above is a clinical trial exclusion criterion. Annotated with entity spans:
patient [Negation: not] [Temporal: previously] [Mood: scheduled for] [Procedure: radiofrequency ablation] of the [Qualifier: cervical], [Qualifier: thoracic], or [Qualifier: lumbar facets], or [Qualifier: sacroiliac joints]